Clinical trial exclusion criterion:
Has known active central nervous system(CNS) metastases

Entity relations:
- Subsumes("central nervous system", "CNS")
- Has_qualifier("metastases", "central nervous system")